School districts in the 2 urban regions of the study area

The above is a clinical trial exclusion criterion. Annotated with entity spans:
[Visit: School districts in the 2 urban regions of the study area]